Clinical trial exclusion criterion:
2hr glucose during OGTT >200 mg/dL

Entity relations:
- Has_value("2hr glucose during OGTT", ">200 mg/dL")